Según Kazdin, ¿cómo se denomina al incremento significativo de la intensidad o de la frecuencia de una conducta cuando se comienza a aplicar un programa de extinción a dicha conducta?:
1. Estallido de la extinción.
2. Recuperación espontánea.
3. Graduación de la extinción.
4. Eficacia de la extinción.
5. Castigo positivo.

Respuesta correcta: 1. Estallido de la extinción.